下列何種藥物最不會降低荷爾蒙避孕藥的避孕效果？
A. 抗結核菌藥物
B. 抗凝血藥物
C. 抗癲癇藥物
D. 抗黴菌藥物

正確答案：B. 抗凝血藥物